Clinical trial inclusion criteria:
Chronic hepatitis B,
Antiviral experienced,
Currently on long term TDF anti-HBV treatment,
HBV DNA < 6 log IU/ml (LLOD)
Able to sign the consent form of anticipating in the study

Annotated entities:
- Condition: "Chronic hepatitis B"
- Drug: "Antiviral"
- Mood: "experienced"
- Observation: "experienced"
- Drug: "TDF"
- Procedure: "TDF anti-HBV treatment"
- Multiplier: "long term"
- Condition: "HBV"
- Measurement: "HBV DNA"
- Value: "< 6 log IU/ml"
- Qualifier: "LLOD"
- Informed_consent: "Able to sign the consent form of anticipating in the study"